Clinical trial inclusion criterion:
Patients willing and able to sign the informed consent

Annotated entities:
- Informed_consent: "Patients willing and able to sign the informed consent"